Clinical trial inclusion criterion:
with the diagnosis of sepsis (as specified below) within the previous 24 hours

Annotated entities:
- Condition: "sepsis"
- Temporal: "within the previous 24 hours"